下列有關止痛治療藥物的敘述，何者錯誤？
A. 類鴉片止痛藥物可用於術後止痛與非術後止痛
B. 類固醇藥物可用於止痛治療
C. 神經肌肉阻斷劑也具有止痛作用
D. 抗癲癇藥物可用於止痛治療

正確答案：C. 神經肌肉阻斷劑也具有止痛作用